Unos padres acuden a urgencias con su hijo de dos años porque refieren que se ha dado un golpe cerca del ojo derecho jugando. Efectivamente se observa un hematoma en el párpado derecho aparentemente sin importancia. En el fondo de ojo se observan hemorragias intrarretinianas no sólo en el ojo que refieren los padres sino también en el otro ojo. Llama la atención que el niño parece adormilado y con poco tono. ¿Cuál de las siguientes afirmaciones debería considerar respecto a este cuadro clínico?
1. Es una historia altamente sugestiva de maltrato infantil.
2. Es la evolución normal de un traumatismo intraocular no perforante.
3. El diagnóstico más probable es un edema de Berlin.
4. Es el cuadro característico de la angiopatía retiniana traumática de Purstcher.

Respuesta correcta: 1. Es una historia altamente sugestiva de maltrato infantil.